乳腺內側的淋巴主要匯入：
A. 肩胛下淋巴結（Subscapular lymph nodes）
B. 前胸淋巴結（Anterior pectoral nodes）
C. 鎖骨下淋巴結（Infraclavicular nodes）
D. 旁胸淋巴結（Parasternal nodes）

正確答案：D. 旁胸淋巴結（Parasternal nodes）